Clinical trial exclusion criterion:
History of malignancy;

Annotated entities:
- Condition: "malignancy"